Con respecto a los tratamientos psicológicos efectivos para la depresión, se puede afirmar que:
1. Son tratamientos más caros (en términos de eficiencia) que los psicofármacos.
2. Han sido propuestos por la guía NICE ( National Institute for Health and Clinical Excellence) como segundo tratamiento de elección para aquellos casos en que los fármacos no se hayan mostrado eficaces.
3. En general, tienden a ser más eficaces aquellos tratamientos psicológicos que utilizan metodologías activas, limitadas en el tiempo y estructuradas.
4. Generan un número similar de abandonos que la terapia farmacológica.
5. Generan un mayor nivel de estigma que las terapias farmacológicas.

Respuesta correcta: 3. En general, tienden a ser más eficaces aquellos tratamientos psicológicos que utilizan metodologías activas, limitadas en el tiempo y estructuradas.